維生素 B12 缺乏之 megaloblastic anemia 患者在未治療前，實驗室檢查最不可能出現下列那種結果？
A. 網狀紅血球增加
B. 乳酸脫氫酶（LDH）上升
C. Unconjugated bilirubin 增加
D. 血小板減少

正確答案：A. 網狀紅血球增加